5. Pregnant female.

The above is a clinical trial exclusion criterion. Annotated with entity spans:
[Parsing_Error: 5.] [Condition: Pregnant] [Person: female].